Clinical trial exclusion criteria:
age > 80 years;
Kellgren-Lawrence score at X-ray evaluation > 3;
major axial deviation (varus >5° , valgus > 5°),
systemic disorders such as diabetes, rheumatoid arthritis, haematological diseases (coagulopathy), severe cardiovascular diseases, infections, immunodepression;
patients in therapy with anticoagulants or antiaggregants;
use of NSAIDs in the 5 days before blood donation;
patients with Hb values < 11 g/dl and platelet values < 150,000/mmc.

Annotated entities:
- Person: "age"
- Value: "> 80 years"
- Measurement: "Kellgren-Lawrence score"
- Procedure: "X-ray evaluation"
- Value: "> 3"
- Condition: "major axial deviation"
- Measurement: "varus"
- Measurement: "valgus"
- Value: ">5°"
- Value: "> 5°"
- Condition: "systemic disorders"
- Condition: "diabetes"
- Condition: "rheumatoid arthritis"
- Condition: "haematological diseases"
- Condition: "coagulopathy"
- Qualifier: "severe"
- Condition: "cardiovascular diseases"
- Condition: "infections"
- Condition: "immunodepression"
- Drug: "anticoagulants"
- Drug: "antiaggregants"
- Procedure: "therapy"
- Drug: "NSAIDs"
- Temporal: "in the 5 days before blood donation"
- Measurement: "Hb"
- Value: "< 11 g/dl"
- Measurement: "platelet"
- Value: "< 150,000/mmc"